Clinical trial inclusion criterion:
Female participants must use a contraceptive method.

Annotated entities:
- Person: "Female"
- Procedure: "contraceptive method"